3. Documented radiographic disease progression < 12 months after the last dose of first- or second-line platinum-based chemotherapy.

The above is a clinical trial inclusion criterion. Annotated with entity spans:
[Parsing_Error: 3.] Documented [Procedure: radiographic] [Condition: disease progression] [Temporal: < 12 months after the last dose of first- or second-line platinum-based chemotherapy].